Clinical trial exclusion criterion:
Lower limb contractures impeding range of motion necessary for ambulation

Annotated entities:
- Condition: "Lower limb contractures"
- Mood: "impeding"
- Observation: "range of motion necessary for ambulation"